Joint contracture

The above is a clinical trial exclusion criterion. Annotated with entity spans:
[Condition: Joint contracture]